En el marco de tratamiento de la Ansiedad Generalizada, se distingue (p. ej., Dugas y Ladouceur, 1997) entre preocupaciones por acontecimientos basados en la realidad, en cuyo caso se entrenaría al paciente en Resolución de Problemas, y preocupaciones por acontecimientos no basados en la realidad y altamente improbables que deberían abordarse mediante el empleo de:
1. Exposición funcional cognitiva.
2. Relajación aplicada.
3. Técnicas de distracción.
4. Meditación.
5. Autoinstrucciones.

Respuesta correcta: 1. Exposición funcional cognitiva.